Las células del nodo sinusal presentan:
1. Potencial de membrana estable.
2. Capacidad contráctil.
3. Despolarización más rápida que las fibras de Purkinje.
4. Despolarización mediada por canales de Ca2+.
5. Larga meseta.

Respuesta correcta: 4. Despolarización mediada por canales de Ca2+.